Clinical trial exclusion criterion:
Mild OSA and patients with BMI over 40 kg/m2.

Entity relations:
- Has_value("BMI", "over 40 kg/m2")